Cannot understand English, Cantonese or Putonghua

The above is a clinical trial exclusion criterion. Annotated with entity spans:
[Non-query-able: Cannot understand English, Cantonese or Putonghua]